Clinical trial exclusion criterion:
contraceptive implant

Annotated entities:
- Device: "contraceptive implant"